Clinical trial exclusion criterion:
HIV regimens containing tenofovir or tipranavir/ritonavir

Entity relations:
- OR("tenofovir", "tipranavir/ritonavir")